Clinical trial exclusion criterion:
Any suicidal behavior in the past based on the C-SSRS

Annotated entities:
- Condition: "suicidal behavior"
- Temporal: "in the past"
- Procedure: "C-SSRS"